Clinical trial inclusion criterion:
Post-operative complication of an act of neurosurgery or programmed neuroradiology

Entity relations:
- multi("of an act of neurosurgery", "neurosurgery")
- multi("of an act of programmed neuroradiology", "neuroradiology")
- Has_qualifier("Post-operative complication", "of an act of neurosurgery")
- OR("of an act of neurosurgery", "of an act of programmed neuroradiology")